Female age 20-50 y/o who plan to undergo abdominal myomectomy for symptomatic myomatous uterus

The above is a clinical trial inclusion criterion. Annotated with entity spans:
[Person: Female] [Person: age] [Value: 20-50 y/o] who [Mood: plan to undergo] [Procedure: abdominal myomectomy] for [Qualifier: symptomatic] [Condition: myomatous uterus]